下列有關骨髓炎（osteomyelitis）的敘述，何者錯誤？
A. ESR 可作為治療反應的追蹤指數
B. Streptococcus 是骨髓炎最常見的致病菌
C. 小孩子的骨髓炎好發於長骨（long bones）
D. 治療時間常需要 4～6 星期以上

正確答案：B. Streptococcus 是骨髓炎最常見的致病菌